¿Cuántos grados de libertad tiene un test de t de Student aplicado a dos muestras relacionadas con un total de 25 individuos?
1. 26.
2. 24.
3. 23.
4. 48.
5. 47.

Respuesta correcta: 2. 24.